Clinical trial inclusion criterion:
Normal renal function (defined as serum creatinine level <133 µmol/L and Estimated Glomerular Filtration Rate (eGFR) greater than or equal to 60)

Annotated entities:
- Condition: "Normal renal function"
- Measurement: "serum creatinine level"
- Value: "<133 µmol/L"
- Measurement: "Estimated Glomerular Filtration Rate (eGFR)"
- Value: "greater than or equal to 60"